Administration of immunoglobulins and/or any blood products since birth or planned administration during the active phase of the study.

The above is a clinical trial exclusion criterion. Annotated with entity spans:
Administration of [Drug: immunoglobulins] and/or [Drug: any blood products] [Temporal: since birth] or [Mood: planned] administration [Temporal: during the active phase of the study].